Clinical trial inclusion criterion:
Ability to read and respond to questions in French or English.

Annotated entities:
- Non-query-able: "Ability to read and respond to questions in French or English."